Clinical trial exclusion criterion:
Left ventricular ejection fraction less than 50 per cent

Entity relations:
- Has_value("Left ventricular ejection fraction", "less than 50 per cent")